No informed consent for participation in the study, mental illness, which don't allow to obtain informed consent and conduct the treatment according to the protocol

The above is a clinical trial exclusion criterion. Annotated with entity spans:
[Non-query-able: No informed consent for participation in the study, mental illness, which don't allow to obtain informed consent and conduct the treatment according to the protocol]